Aged at least 18 years with an ability and willingness to give written informed consent.

The above is a clinical trial inclusion criterion. Annotated with entity spans:
[Person: Aged] [Value: at least 18 years] with an [Observation: ability] and [Observation: willingness] to give written informed consent.